Clinical trial inclusion criterion:
BMI between 20 and 34 kg/m2

Annotated entities:
- Measurement: "BMI"
- Value: "between 20 and 34 kg/m2"